Which are the uses of deep learning models in Duchenne Muscular Dystrophy?

Deep Learning of Ultrasound Imaging for Evaluating Ambulatory Function of Individuals with Duchenne Muscular Dystrophy.